Positive drug addictions* (verbal interrogatory)

The above is a clinical trial exclusion criterion. Annotated with entity spans:
[Condition: Positive drug addictions]* ([Procedure: verbal interrogatory])